Any allogeneic stem cell transplant recipient = 14 years of age and = 60 years of age

The above is a clinical trial inclusion criterion. Annotated with entity spans:
Any [Procedure: allogeneic stem cell transplant] recipient [Value: = 14 years] of [Person: age] and [Value: = 60 years] of [Person: age]